Clinical trial exclusion criterion:
History of ventricular tachycardia within 3 months before study entry; second- or third-degree atrioventricular block.

Entity relations:
- Has_temporal("ventricular tachycardia", "within 3 months")
- OR("ventricular tachycardia", "second- degree atrioventricular block", "third-degree atrioventricular block")